Clinical trial exclusion criterion:
Long-standing persistent or permanent atrial fibrillation.

Entity relations:
- Has_qualifier("atrial fibrillation", "persistent")
- OR("persistent", "permanent")